Age 1-59 months,

The above is a clinical trial inclusion criterion. Annotated with entity spans:
[Person: Age] [Value: 1-59 months],